Clinical trial exclusion criterion:
History of kidney transplant

Annotated entities:
- Procedure: "kidney transplant"
- Temporal: "History"